Inability to comply with study requirements.

The above is a clinical trial exclusion criterion. Annotated with entity spans:
[Post-eligibility: Inability to comply with study requirements.]